Receipt of live-virus vaccines within 28 days prior to the initiation of study treatment or need for live-virus vaccines at any time during study treatment.

The above is a clinical trial exclusion criterion. Annotated with entity spans:
Receipt of [Drug: live-virus vaccines] [Temporal: within 28 days prior] to [Reference_point: the initiation of study treatment] or [Non-query-able: need for] [Drug: live-virus vaccines] at [Temporal: any time during] [Reference_point: study treatment].